Decompensated heart failure

The above is a clinical trial exclusion criterion. Annotated with entity spans:
[Qualifier: Decompensated] [Condition: heart failure]